一位 3 歲的男孩，脊椎變形在出生不久即被注意到，而且隨著年齡愈大，脊椎畸形愈嚴重。脊椎 X 光檢查發現是先天性脊椎側彎，在凸側（convex side）第一腰椎有一半椎體（hemivertebra），而在凹側（concave side）第十二胸椎及第一腰椎有一不分節棒（unsegmental bar），側彎度數 40 度，此時最好的治療是：
A. 繼續觀察
B. 背架治療
C. 手術治療
D. 電刺激治療

正確答案：C. 手術治療